¿Cuál de los siguientes fármacos obtenidos mediante técnicas de ingeniería molecular no es de aplicación en el tratamiento de la artritis reumatoide?:
1. Influximab.
2. Denosumab.
3. Adalimumab.
4. Anakinra.
5. Etanercept.

Respuesta correcta: 2. Denosumab.